Clinical trial exclusion criterion:
Known hypersensitivity to Ferinject®.

Annotated entities:
- Condition: "hypersensitivity"
- Drug: "Ferinject®"